以下有關 β-lactam 抗生素之敘述，何者正確？
A. 結合 penicillin binding proteins（PBPs），改變細胞膜功能
B. 穿透性（permeability）差是細菌產生抗藥性最常見的原因
C. vancomycin 屬於 β-lactam 抗生素
D. 黴漿菌（Mycoplasma）對 β-lactam 抗生素具抗藥性

正確答案：D. 黴漿菌（Mycoplasma）對 β-lactam 抗生素具抗藥性